Clinical trial inclusion criterion:
Hepatic function, as follows: Aspartate aminotransferase (AST) <=3 x ULN, Alanine aminotransferase (ALT) <=3 x ULN, Total Bilirubin <=1.5 x ULN.

Entity relations:
- Has_value("spartate aminotransferase (AST)", "<=3 x ULN")
- Has_value("Alanine aminotransferase (ALT)", "<=3 x ULN")
- Has_value("Total Bilirubin", "<=1.5 x ULN")